有一個 10 歲心智發育遲緩男孩，能自行負責日常起居。病人具短頭（Brachycephaly）、瞼裂較斜，並具顯內眥贅皮摺。病人並有手掌斷掌紋。胸部理學檢查則顯示具有 Grade Ⅲ/Ⅵ之收縮性雜音。下列疾病最可能在 20 歲時發生？
A. 急性白血病
B. 肝硬化
C. 慢性腎衰竭
D. 急性心肌梗塞

正確答案：A. 急性白血病